El electrodo de Clark tiene fundamento:
1. Potenciométrico.
2. Potenciostático.
3. Óptico.
4. Amperométrico.
5. Conductimétrico.

Respuesta correcta: 4. Amperométrico.